Clinical trial exclusion criterion:
Subject with known history of intestinal obstruction or current obstructive symptoms, such as severe abdominal pain with accompanying nausea or vomiting, based on investigator judgment.

Entity relations:
- Has_temporal("intestinal obstruction", "history")
- Has_temporal("obstructive symptoms", "current")
- Subsumes("obstructive symptoms", "severe abdominal pain")
- Subsumes("obstructive symptoms", "nausea")
- Subsumes("obstructive symptoms", "vomiting")
- OR("intestinal obstruction", "obstructive symptoms")
- OR("nausea", "vomiting")